Clinical trial exclusion criterion:
History of hypersensitivity to vaccines.

Entity relations:
- AND("History", "hypersensitivity to vaccines")